¿Es muy reactivo el hidrógeno a temperatura ambiente?
1. Si, reacciona con todos los elementos a temperatura ambiente.
2. No, pero a temperaturas altas el hidrógeno reacciona vigorosamente con metales y no metales.
3. No, incluso en presencia de catalizadores como [RhCI(PPh3)3] necesita temperaturas muy altas y grandes presiones para hidrogenar olefinas.
4. Si, por ejemplo es muy conocido que reacciona con el nitrógeno a temperatura ambiente para dar amoniaco, siguiendo el procedimiento Haber.

Respuesta correcta: 2. No, pero a temperaturas altas el hidrógeno reacciona vigorosamente con metales y no metales.